Estimated life expectancy (due to comorbidities) less than 90 days

The above is a clinical trial exclusion criterion. Annotated with entity spans:
[Person: Estimated life expectancy] (due to comorbidities) [Value: less than 90 days]